current substance use disorder

The above is a clinical trial exclusion criterion. Annotated with entity spans:
[Temporal: current] [Condition: substance use disorder]